pregnancy

The above is a clinical trial exclusion criterion. Annotated with entity spans:
[Condition: pregnancy]